La incapacidad para reconocer los rostros, preservando el sentido de la vista, se denomina:
1. Disparidad binocular.
2. Hemiplejia.
3. Disfasia.
4. Prosopagnosia.
5. Apraxia.

Respuesta correcta: 4. Prosopagnosia.